下列關於 glucose 在人類的紅血球中代謝的敘述，何者錯誤？
A. glucose 代謝最終產物之一為 lactic acid
B. pyruvate 可轉化為 acetyl-CoA 進一步代謝
C. ATP 產量較少
D. glucose 也可以利用 pentose phosphate 途徑代謝

正確答案：B. pyruvate 可轉化為 acetyl-CoA 進一步代謝